¿Cuál de estas teorías explica por qué es más fácil que un niño adquiera una respuesta condicionada de temor ante un pequeño insecto que ante un mando a distancia?:
1. La teoría bifactorial de Mowrer.
2. La teoría de la preparación biológica de Seligman.
3. La teoría de la incubación de Eysenck.
4. Las teorías de expectativas de ansiedad (por ejemplo, el modelo de Reiss).

Respuesta correcta: 2. La teoría de la preparación biológica de Seligman.